下列治療高血鉀之方法，何者能增加鉀離子之排泄？
A. 葡萄酸鈣（calcium gluconate）
B. 陽離子交換樹酯（cation-exchange resin）
C. 胰島素（insulin）
D. 鹼治療（alkali therapy）

正確答案：B. 陽離子交換樹酯（cation-exchange resin）